Post infection of knee

The above is a clinical trial exclusion criterion. Annotated with entity spans:
[Temporal: Post] [Condition: infection of knee]